De las siguientes escalas de valoración del dolor en la infancia, ¿cuál de ellas se recomienda para los escolares de 7 a 8 años?:
1. Escala NFCS.
2. Escala numérica o analógica.
3. Escala CHEOPS.
4. Escala Oucher.
5. Escala de Wong y Baker.

Respuesta correcta: 2. Escala numérica o analógica.